Clinical trial exclusion criterion:
1. Are unable to understand and sign the consent form

Annotated entities:
- Non-query-able: "Are unable to understand and sign the consent form"
- Post-eligibility: "Are unable to understand and sign the consent form"